Clinical trial exclusion criterion:
History of intracranial hemorrhage

Annotated entities:
- Temporal: "History"
- Condition: "intracranial hemorrhage"